Clinical trial inclusion criterion:
Control: devoid of any systemic or neurological diseases

Annotated entities:
- Negation: "devoid"
- Condition: "neurological diseases"
- Condition: "systemic diseases"